contraindication to laparoscopy

The above is a clinical trial exclusion criterion. Annotated with entity spans:
[Condition: contraindication] to [Procedure: laparoscopy]